Clinical trial inclusion criterion:
11. Target lesions(s) is (are) located in an infarct (if not treated with primary PCI) or non-infarct-related artery with a 70% or greater stenosis (by visual estimate) more than 72 hours following the ST segment elevation myocardial infarction (STEMI).

Entity relations:
- AND("in an infarct -related artery", "infarct")
- Has_negation("primary PCI", "not")
- Has_value("stenosis", "70% or greater")
- AND("Target lesions", "stenosis")
- Has_qualifier("Target lesions", "in an infarct -related artery")
- Has_index("more than 72 hours following the ST segment elevation myocardial infarction (STEMI)", "the ST segment elevation myocardial infarction (STEMI)")
- AND("the ST segment elevation myocardial infarction (STEMI)", "ST segment elevation myocardial infarction (STEMI)")
- Has_temporal("stenosis", "more than 72 hours following the ST segment elevation myocardial infarction (STEMI)")
- AND("Target lesions", "primary PCI")
- OR("in an infarct -related artery", "non-infarct-related artery")